45歲女性，有間歇性恥骨上方疼痛、頻尿、血尿及排尿疼痛。病理顯微變化可見膀胱黏膜有慢性潰瘍，膀胱壁有慢性發炎細胞浸潤及纖維化。下列何者為最可能的診斷？
A. 息肉狀膀胱炎
B. 濾泡性膀胱炎
C. 間質性膀胱炎
D. 出血性膀胱炎

正確答案：C. 間質性膀胱炎